Clinical trial exclusion criterion:
Hyper- or hypothyroidism (subjects requiring medication to maintain TSH levels in the normal range are eligible if all other inclusion/exclusion criteria are met)

Annotated entities:
- Condition: "hypothyroidism"
- Condition: "Hyper thyroidism"
- Drug: "medication"
- Non-query-able: "subjects requiring medication to maintain TSH levels in the normal range are eligible if all other inclusion/exclusion criteria are met"